Clinical trial exclusion criterion:
uncontrolled hypertension (> 180/100 mmHg)

Entity relations:
- Has_value("uncontrolled hypertension", "> 180/100 mmHg")